下列何項理學檢查結果不是次發性高血壓之特徵？
A. 滿月臉（Moon face）
B. 上肢發育明顯優於下肢
C. 腹部肚臍附近聽見連續亂流聲（bruits）
D. 主動脈區聽見第二度收縮期雜音

正確答案：D. 主動脈區聽見第二度收縮期雜音